Which cytokine molecule activates SMADs?

Activated SMADs are phosphorylated by TGF-β superfamily type I receptors at two serine residues at an S-M/V-S motif at their extreme C-terminus. Once phosphorylated, activated R-SMADs form complexes with SMAD4, which accumulate in the nucleus where they activate or repress transcription.